Clinical trial exclusion criterion:
AST to platelet ratio index (APRI) =2.0 and Fibrosis-4 (FIB-4) =3.25

Annotated entities:
- Measurement: "AST to platelet ratio index (APRI)"
- Value: "=2.0"
- Measurement: "Fibrosis-4 (FIB-4)"
- Value: "=3.25"